Which disease is treated with Emapalumab?

Emapalumab is a human monoclonal antibody directed against interferon-γ (IFN-γ) that was approved by the Food and Drug Administration for primary hemophagocytic lymphohistiocytosis (HLH).